Known or suspected gram-negative infections, anaerobic infections, or fungemia

The above is a clinical trial exclusion criterion. Annotated with entity spans:
Known or suspected [Qualifier: gram-negative] [Condition: infections], [Qualifier: anaerobic] [Condition: infections], or [Condition: fungemia]